El método de las variaciones continuas se utiliza en espectrofotometría de absorción molecular para :
1. Determinar la posición del punto isobéstico en una mezcla de especies absorbentes.
2. Calcular la posición exacta del máximo de absorción de un complejo absorbente.
3. Obtener el pH correspondiente al punto final de la valoración de un ácido o una base absorbentes.
4. Calcular la estequiometría de un complejo absorbente.
5. Calcular el valor exacto de la constante de disociación de un ácido absorbente.

Respuesta correcta: 4. Calcular la estequiometría de un complejo absorbente.